Clinical trial inclusion criterion:
Women: (0.005835 x H3) + (15 x W) + 183 = TBV [H=height in inches; W=weight in pounds]

Annotated entities:
- Person: "Women"
- Measurement: "TBV"
- Value: "(0.005835 x H3) + (15 x W) + 183"